腸內桿菌科（Enterobacteriaceae）細菌對下列何種糖類的發酵能力，常被用來作為初步鑑定之用？
A. 葡萄糖（glucose）
B. 蔗糖（sucrose）
C. 乳糖（lactose）
D. 阿拉伯糖（arabinose）

正確答案：C. 乳糖（lactose）